Clinical trial inclusion criterion:
2. Patients with PHN must have had pain >3 months after rash healing

Annotated entities:
- Condition: "PHN"
- Multiplier: ">3 months"
- Temporal: "after rash healing"
- Reference_point: "rash healing"
- Condition: "rash healing"
- Condition: "pain"